Patients not willing to fill consent/ assent form are also excluded from study.

The above is a clinical trial exclusion criterion. Annotated with entity spans:
[Post-eligibility: Patients not willing to fill consent/ assent form are also excluded from study.]